Clinical trial exclusion criterion:
Bleeding disorder, or receipt of anticoagulants in the 3 weeks preceding inclusion, contraindicating intramuscular vaccination

Entity relations:
- Has_index("in the 3 weeks preceding inclusion", "inclusion")
- Subsumes("contraindicating", "intramuscular vaccination")
- Has_temporal("Bleeding disorder", "in the 3 weeks preceding inclusion")
- OR("Bleeding disorder", "anticoagulants")